Which biomarkers are currently used for Duchenne Muscular Dystrophy?

MRI measurements can be used as biomarkers of disease severity in ambulant patients with DMD. malate dehydrogenase 2 as candidate prognostic biomarker for Duchenne muscular dystrophy